一70歲男性，有長期菸酒檳榔的使用習慣，因最近常常有間歇性的右耳疼痛情形，但耳部檢查完全正常。在未進行下一步檢查之前，若此症狀與頭頸癌相關，最有可能是下列那個部位的癌症？
A. 舌癌
B. 聲門癌
C. 扁桃腺癌
D. 頰黏膜癌

正確答案：C. 扁桃腺癌